Si queremos evaluar la inteligencia en un niño de 10 años, podríamos utilizar una de las siguientes escalas Wechsler:
1. WPPSI.
2. WISC-IV.
3. WAIS-III.
4. WIPSI.

Respuesta correcta: 2. WISC-IV.